Which genes belong to the AUX/IAA family of transcription repressors in plants?

The Aux/IAA proteins are auxin-sensitive repressors that mediate diverse physiological and developmental processes in plants [1, 2]. The tomato Aux/IAA transcription factor IAA9 is involved in fruit development and leaf morphogenesis. There are 29 Aux/IAA genes in Arabidopsis that exhibit unique but partially overlapping patterns of expression. Several DREB/CBF TFs directly promote transcription of the IAA5 and IAA19 genes in response to abiotic stress. Plant Stress Tolerance Requires Auxin-Sensitive Aux/IAA Transcriptional Repressors. While no mutation in any member of subfamily IV has been reported to date, the phenotypes associated with the downregulation of IAA9 reveal distinct and novel roles for members of the Aux/IAA gene family. Nce for SCF-mediated ubiquitination of the Aux/IAA proteins SHY2/IAA3 and BDL/IAA12. Aux/IAA proteins are short-lived nuclear proteins that repress expression of primary/early auxin response genes in protoplast transfection assays. We showed that EgrIAA4 protein is localized in the nucleus and functions as an auxin-responsive repressor. Here, we systematically dissect auxin sensing by SCFTIR1-IAA6 and SCFTIR1-IAA19 co-receptor complexes, and assess IAA6/IAA19 ubiquitylation in vitro and IAA6/IAA19 degradation in vivo.